Clinical trial exclusion criterion:
age less than 18 years

Entity relations:
- Has_value("age", "less than 18 years")